Clinical trial inclusion criteria:
Diagnosis of DSM 5 Anxiety Disorder
Stable medical history and general health
On stable anti-parkinsonian therapy for 2 weeks before enrollment

Annotated entities:
- Condition: "DSM 5 Anxiety Disorder"
- Temporal: "Stable medical history"
- Condition: "Stable general health"
- Qualifier: "stable"
- Procedure: "anti-parkinsonian therapy"
- Multiplier: "for 2 weeks"
- Temporal: "before enrollment"